Clinical trial exclusion criterion:
Patient has left ventricular ejection fraction (LVEF) less than 35% not secondary to tachycardia.

Annotated entities:
- Measurement: "left ventricular ejection fraction"
- Measurement: "LVEF"
- Value: "less than 35%"
- Mood: "not secondary to"
- Condition: "tachycardia"